Clinical trial inclusion criterion:
age >18 years

Annotated entities:
- Person: "age"
- Value: ">18 years"